Untreated symptomatic brain or leptomeningeal metastatic disease.

The above is a clinical trial exclusion criterion. Annotated with entity spans:
[Qualifier: Untreated] [Condition: symptomatic brain] or leptomeningeal metastatic disease.